What is the function of WAPL protein on cohesin?

Wapl is a cohesin-binding protein that facilitates cohesin's timely release from chromosome arms during prophase.It promotes the release of cohesin from chromosomes during both interphase and mitosis.